Major surgery within 4 weeks

The above is a clinical trial exclusion criterion. Annotated with entity spans:
[Procedure: Major surgery] [Temporal: within 4 weeks]